Age between 18 and 80 years.

The above is a clinical trial inclusion criterion. Annotated with entity spans:
[Person: Age] [Value: between 18 and 80 years].